Clinical trial inclusion criterion:
weight </= 100kg

Entity relations:
- Has_value("weight", "</= 100kg")